一位 65 歲男性因雙下肢急性無力及麻痺已 2 天而被送至急診，並有尿液滯留及肩疼痛，左下肢肌力測試為 3/5，且右側髖部屈曲為 4/5，雙側 Babinski sign 且膝及踝深部肌腱反射增強（hyperreflexic knee and jerk），乳頭以下對針刺感覺（pin-prick sensation）喪失，其最可能之診斷為何？
A. 多發性肌炎（Polymyositis）
B. 脊髓病變（Myelopathy）
C. 多發性神經根炎（Polyradiculitis）
D. 硬膜下血腫（Subdural hematoma）

正確答案：B. 脊髓病變（Myelopathy）